施行心包膜穿刺術（pericardiocentesis）時，由那一個位置下針，可減低刺破肋膜腔（pleural cavity）之機會？
A. 胸骨右側第六肋間
B. 胸骨左側第三肋間
C. 胸骨劍突（sternal xiphoid process）與左肋下緣交點
D. 胸骨右側第四肋間

正確答案：C. 胸骨劍突（sternal xiphoid process）與左肋下緣交點